En la ruta que conduce en el hígado a la biosíntesis de acetoacetato a partir de acetil CoA, ¿Cuál de las sustancias siguientes es el precursor inmediato del acetoacetato?
1. 3-Hidroxibutirato.
2. Acetoacetil CoA.
3. 3-Hidroxibutiril CoA.
4. Ácido mevalónico.
5. 3-Hidroxi-3-metilglutaril. CoA.

Respuesta correcta: 5. 3-Hidroxi-3-metilglutaril. CoA.